Multiple bone metastasis or central nervous system metastasis

The above is a clinical trial exclusion criterion. Annotated with entity spans:
[Condition: Multiple bone metastasis] or [Condition: central nervous system metastasis]